Lesion larger than 4 cm in the longest dimension

The above is a clinical trial exclusion criterion. Annotated with entity spans:
[Condition: Lesion] [Value: larger than 4 cm] in the [Measurement: longest dimension]